下列有關大腸直腸癌（colorectal cancer, CRC）的敘述，何者錯誤？
A. CRC 的危險因子包括年紀50歲以上，一等親有 CRC 之家族史，曾患炎性腸病
B. 90% 的CRC出現在脾曲（splenic flexure）以下，可用乙狀結腸鏡（sigmoidoscopy）檢查發現
C. 右側大腸之CRC，常出現貧血
D. 左側大腸之CRC，會出現排便習慣改變或血便

正確答案：B. 90% 的CRC出現在脾曲（splenic flexure）以下，可用乙狀結腸鏡（sigmoidoscopy）檢查發現